有關甲狀腺亢進與精神疾病的關聯性，下列何者錯誤？
A. 甲狀腺亢進可能說話會滔滔不絕
B. 甲狀腺亢進不會造成認知功能缺損
C. 甲狀腺亢進可能產生視幻覺、被害意念以及譫妄症
D. 雖然甲狀腺亢進與躁症病因不同，但其臨床表現可能相似

正確答案：B. 甲狀腺亢進不會造成認知功能缺損